與擴大型心肌病預後（prognosis）無關的指標是：
A. 紐約心臟學會對心臟病病人之功能評估與治療分級
B. 左心室心舒內徑（diastolic dimension）增大
C. 血清鉀濃度減低
D. 運動極致耗氧量（peak O2 consumption）

正確答案：C. 血清鉀濃度減低